Clinical trial exclusion criterion:
previous pelvic surgeries

Annotated entities:
- Procedure: "pelvic surgeries"
- Temporal: "previous"